Clinical trial exclusion criterion:
5. Women who are pregnant or lactating.

Entity relations:
- OR("pregnant", "lactating")